Clinical trial inclusion criteria:
All patients (excluding neonates) requiring one or more allogeneic RBC transfusions for the treatment of anemia will be included.

Annotated entities:
- Person: "neonates"
- Negation: "excluding"
- Multiplier: "one or more"
- Procedure: "RBC transfusions"
- Qualifier: "allogeneic"
- Condition: "anemia"
- Procedure: "treatment"
- Mood: "requiring"